一位 65 歲的男性因兩側、多處、對稱性 metacarpo-phalangeal（MCP）joints 紅、腫約一週而就診。期間未服用任何藥物。檢查可見抗核抗體（ANA）效價為 1:640，每天蛋白尿流失量約 3 公克。則下列何種檢查的結果對診斷最有幫助？
A. ESR 90 mm/hr
B. X 光檢查可見兩側、多處、對稱性 MCP 關節旁軟組織腫脹
C. rheumatoid factor 100 IU/mL（normal < 20）
D. anti-double stranded DNA antibody titer 100 IU/mL（normal < 30）

正確答案：D. anti-double stranded DNA antibody titer 100 IU/mL（normal < 30）